Adequate performance status:

The above is a clinical trial inclusion criterion. Annotated with entity spans:
[Non-representable: Adequate performance status]: